Clinical trial exclusion criterion:
Tetracycline treatment within two weeks

Entity relations:
- Has_temporal("Tetracycline", "within two weeks")